Use of prescription medications on a regular basis. The last use of any prescription medication must have been greater than 5 half-lives for the specific medication or at least 14 days prior to admission (Day -1), whichever is longer. Hormonal contraception is allowed for female subjects.

The above is a clinical trial exclusion criterion. Annotated with entity spans:
Use of [Drug: prescription medications] on a [Temporal: regular basis]. The [Temporal: last use] of [Drug: any prescription medication] must have been greater than 5 half-lives for the specific medication or [Temporal: at least 14 days prior to admission] (Day -1), whichever is longer. [Procedure: Hormonal contraception] [Grammar_Error: is allowed] for [Person: female] subjects.